Clinical trial exclusion criterion:
2. Abnormal blood biochemistry defined as 3 times that of the upper limit of the normal range.

Entity relations:
- Subsumes("Abnormal", "3 times that of the upper limit of the normal range")
- Has_value("blood biochemistry", "Abnormal")